Clinical trial inclusion criterion:
Fibroscan showing cirrhosis or results > 12.5 kPa

Annotated entities:
- Procedure: "Fibroscan"
- Condition: "cirrhosis"
- Value: "> 12.5 kPa"